國際癌症研究機構（IARC）將流病資料不充分且動物資料有限之可能致癌物，列為那一類？
A. 1
B. 2A
C. 2B
D. 3

正確答案：C. 2B